下列何者不是世界衛生組織（WHO）對胃腺癌（adenocarcinoma）的分類型態？
A. Signet ring
B. Tubular type
C. Follicular type
D. Mucinous type

正確答案：C. Follicular type